¿A qué conclusión se llega en la teoría de Asch sobre los efectos del contexto en la percepción social?
1. Si un rasgo se define como central, será central en cualquier contexto.
2. Los rasgos, periféricos o centrales, son independientes del contexto en el que aparezcan.
3. Un mismo rasgo puede ser central en un contexto y periférico en otro.
4. La impresión final es el resultado de la suma de cada uno de los rasgos por separado.
5. La impresión final es el resultado de la media aritmética de los valores de cada uno de los rasgos por separado.

Respuesta correcta: 3. Un mismo rasgo puede ser central en un contexto y periférico en otro.